Clinical trial exclusion criterion:
History of moderate to severe traumatic brain injury or mild traumatic brain injury with ongoing post-concussive symptoms;

Entity relations:
- Has_qualifier("traumatic brain injury", "mild")
- AND("traumatic brain injury", "post-concussive symptoms")
- Has_qualifier("traumatic brain injury", "moderate")
- OR("moderate", "severe")
- OR("traumatic brain injury", "traumatic brain injury")